Uncontrolled myocardial ischemia (repeated chest pain or dyspnea after revascularization)

The above is a clinical trial exclusion criterion. Annotated with entity spans:
[Qualifier: Uncontrolled] [Condition: myocardial ischemia] ([Qualifier: repeated] [Condition: chest pain] or [Condition: dyspnea] [Temporal: after revascularization])